No cognitive deficits

The above is a clinical trial inclusion criterion. Annotated with entity spans:
[Negation: No] [Condition: cognitive deficits]